Según el artículo 56 de la Ley General de Sanidad de 1986, “la estructura responsable de la gestión unitaria de los centros, prestaciones y programas sanitarios a desarrollar en su demarcación territorial” es:
1. Centro integral de atención especializada.
2. Centro de Salud.
3. Zona Básica de Salud.
4. Equipo de Atención Primaria.
5. Área de Salud.

Respuesta correcta: 5. Área de Salud.